Clinical trial exclusion criterion:
High bleeding risk or spontaneously prolonged prothrombin time or activated partial thromboplastin time > 1.5 x ULN

Annotated entities:
- Condition: "High bleeding risk"
- Condition: "prolonged prothrombin time"
- Qualifier: "spontaneously"
- Measurement: "activated partial thromboplastin time"
- Value: "> 1.5 x ULN"